Clinical trial inclusion criterion:
PCOS diagnosis based on 2003 Rotterdam criteria

Annotated entities:
- Condition: "PCOS"
- Qualifier: "2003 Rotterdam criteria"